bariatric surgery

The above is a clinical trial exclusion criterion. Annotated with entity spans:
[Procedure: bariatric surgery]